一位七十歲女性，左側下眼瞼紅腫疼痛三天，最明顯壓痛點在左鼻側及內眥間有一堅硬紅腫突起，下列敘述何者錯誤？
A. 最有可能的診斷為急性淚囊炎（acute dacryocystitis）
B. 造成此疾病最常見的病原菌為放射菌（Actinomyces israelii）
C. 若未及時以抗生素治療，可能會導致眼窩蜂窩性組織炎
D. 此疾病若反覆發作，須考慮於緩解期做淚囊鼻腔吻合術（dacryocystorhinostomy）

正確答案：B. 造成此疾病最常見的病原菌為放射菌（Actinomyces israelii）